not noticed as bipolar disorder

The above is a clinical trial exclusion criterion. Annotated with entity spans:
[Negation: not] [Mood: noticed] as [Condition: bipolar disorder]